Clinical trial exclusion criterion:
Immunosuppressed/immune compromised

Entity relations:
- OR("Immunosuppressed", "immune compromised")